Clinical trial exclusion criterion:
Serum albumin < 2.0mg/dL

Annotated entities:
- Measurement: "Serum albumin"
- Value: "< 2.0mg/dL"